neurologic condition causing the loss of function of the finger to be treated

The above is a clinical trial exclusion criterion. Annotated with entity spans:
[Condition: neurologic condition] causing the [Condition: loss of function] of the [Qualifier: finger to be treated]